Clinical trial exclusion criterion:
17. Pregnancy or breast-feeding

Annotated entities:
- Parsing_Error: "17."
- Condition: "Pregnancy"
- Condition: "breast-feeding"